Inclusion in another trial without prior agreement with CI

The above is a clinical trial exclusion criterion. Annotated with entity spans:
[Competing_trial: Inclusion in another trial without prior agreement with CI]